Clinical trial inclusion criterion:
1. Age: 12 to 36 months of age (The diagnosis of CP is often uncertain under the age of 12 months. The cutoff at 36 months is to have a population of young children when the brain is most "plastic" and most susceptible to reorganization).

Annotated entities:
- Parsing_Error: "1."
- Person: "Age"
- Value: "12 to 36 months of age"
- Not_a_criteria: "(The diagnosis of CP is often uncertain under the age of 12 months. The cutoff at 36 months is to have a population of young children when the brain is most "plastic" and most susceptible to reorganization)"